Clinical trial exclusion criterion:
Severe hyperlipidemia or severe disorders of lipid metabolism characterized by hypertriglyceridemia (serum triglyceride concentration >1,000 g/dL).

Annotated entities:
- Condition: "hyperlipidemia"
- Qualifier: "Severe"
- Qualifier: "severe"
- Condition: "disorders of lipid metabolism"
- Condition: "hypertriglyceridemia"
- Measurement: "serum triglyceride concentration"
- Value: ">1,000 g/dL"